Clinical trial exclusion criterion:
Patients using medication that could potentiate the effect of botulinum (ex: aminoglycoside antibiotics)

Entity relations:
- AND("medication", "potentiate the effect")
- AND("potentiate the effect", "botulinum")
- Subsumes("medication", "aminoglycoside antibiotics")